Clinical trial exclusion criterion:
inability to correct coagulopathy;

Entity relations:
- AND("correct", "coagulopathy")
- Has_mood("correct", "inability to")